Mujer de 40 semanas de gestación en trabajo de parto con 6 cm de dilatación. Presenta patrón fetal decelerativo en registro cardiotocográfico por lo que se decide realizar microtoma de sangre fetal para valorar bienestar fetal. Resultado pH 7,22. La conducta correcta es:
1. Acidosis grave. Cesárea urgente.
2. Valor prepatológico, repetir toma en 15-20 minutos.
3. Acidosis moderada, repetir toma en 1-2 horas.
4. Valor en límites normales, dejar evolución natural de parto.
5. Repetir en el momento, posible error en la obtención de la toma.

Respuesta correcta: 2. Valor prepatológico, repetir toma en 15-20 minutos.